What is the functional role of the protein Drp1?

Dynamin-related protein 1 (Drp1) mediates mitochondrial fission.